Which IDH inhibitors by Agios Pharmaceuticals have been approved by the FDA?

Enasidenib and ivosidenib, the IDH2 and IDH1 inhibitors developed by Agios Pharmaceuticals, have been approved by the Food and Drug Administration